下列何種內分泌荷爾蒙其 receptor 不是 nuclear hormone receptor？
A. glucocorticoid
B. glucagon
C. thyroid hormone
D. progesterone

正確答案：B. glucagon